Clinical trial exclusion criterion:
lactation

Annotated entities:
- Condition: "lactation"